Clinical trial exclusion criterion:
Renal, hepatic, gastrointestinal, or biliary disorder that could impair absorption, metabolism or excretion of orally administered medication

Entity relations:
- Has_qualifier("disorder", "Renal")
- AND("impair absorption", "orally administered medication")
- AND("disorder", "impair absorption")
- AND("impair metabolism", "orally administered medication")
- AND("impair excretion", "orally administered medication")
- AND("disorder", "impair metabolism")
- AND("disorder", "impair excretion")
- OR("Renal", "gastrointestinal", "hepatic", "biliary")